What nerve is affected in Carpel Tunnel syndrome?

Carpal tunnel syndrome (CTS) is a medical condition due to compression of the median nerve as it travels through the wrist at the carpal tunnel.